Clinical trial inclusion criterion:
Scheduled for total hip replacement surgery

Annotated entities:
- Procedure: "total hip replacement surger"
- Mood: "Scheduled for"